關於韁核（habenular nucleus）的敘述，下列何者錯誤？
A. 位於丘腦上部（epithalamus）
B. 與丘腦髓紋（stria medullaris thalami）相連接
C. 經由韁核腳間核神經路徑（habenular-interpeduncular tract）將訊息傳入中腦（midbrain）
D. 與短期記憶（short term memory）形成密切關聯

正確答案：D. 與短期記憶（short term memory）形成密切關聯